Unwillingness or inability to comply with the procedures described in this protocol

The above is a clinical trial exclusion criterion. Annotated with entity spans:
[Non-query-able: Unwillingness or inability to comply with the procedures described in this protocol]